Clinical trial exclusion criterion:
thrombus in the LA or LAA;

Annotated entities:
- Condition: "thrombus"
- Qualifier: "LA"
- Qualifier: "LAA"